下列有關外傷性窒息（traumatic asphyxia）的敘述，何者錯誤？
A. 因胸部（chest）受到擠壓所致，其典型症狀有結膜下出血、頭、頸部發紺
B. 常發生在胸部遭受重物壓迫的病人
C. 其相關傷害，無需積極治療
D. 肇因於上腔靜脈壓力突然增加

正確答案：C. 其相關傷害，無需積極治療